Clinical trial exclusion criteria:
Tuberculosis resistant to any of the study drugs (isoniazid, rifampin, EMB, PZA, CFZ, Pto)
Unable to take oral medications.
History of allergy or intolerance to any of the study drugs
Serum aminotransferase (AST or ALT) 3x upper limit of normal or higher
Pregnant or nursing females, or plan to become pregnant or nurse during the study period
Males planning to conceive a child during the study or within 6 months of cessation of treatment.
Any treatment directed against active tuberculosis within 6 months preceding initiation of study drugs.
Suspected or documented tuberculosis involving the central nervous system and/or bones and/or joints, and/or miliary tuberculosis and/or pericardial tuberculosis.
HIV infected
HBV infected or HCV infected (these increase the risk of TB-drug induced hepatotoxicity)
Weight less than 40.0 kg.
Known allergy or intolerance to any of the study medications.
Individuals will be excluded from enrollment if, at the time of enrollment, their M. tuberculosis isolate is already known to be resistant to any of the study drugs.
QTcF > 500 msec
Other medical conditions, that, in the investigator's judgment, make study participation not in the individual's best interest.
Current or planned incarceration or other involuntary detention
Having participated in other clinical studies with dosing of investigational agents within 8 weeks prior to trial start or currently enrolled in an investigational study that includes treatment with medicinal agents. Subjects who are participating in observational studies or who are in a follow up period of a trial that included drug therapy may be considered for inclusion.

Annotated entities:
- Condition: "Tuberculosis"
- Qualifier: "resistant to"
- Drug: "study drugs"
- Drug: "isoniazid"
- Drug: "rifampin"
- Drug: "EMB"
- Drug: "PZA"
- Drug: "CFZ"
- Drug: "Pto"
- Observation: "Unable to take oral medications"
- Condition: "allergy"
- Temporal: "History"
- Condition: "intolerance"
- Drug: "study drugs"
- Measurement: "Serum aminotransferase"
- Measurement: "AST"
- Measurement: "ALT"
- Value: "3x upper limit of normal or higher"
- Condition: "Pregnant"
- Observation: "nursing"
- Person: "females"
- Mood: "plan to"
- Observation: "become pregnant"
- Observation: "nurse"
- Temporal: "during the study period"
- Person: "Males"
- Mood: "planning to"
- Observation: "conceive a child"
- Temporal: "during the study"
- Temporal: "within 6 months of cessation of treatment"
- Reference_point: "cessation of treatment"
- Reference_point: "the study"
- Qualifier: "active"
- Condition: "tuberculosis"
- Temporal: "within 6 months preceding initiation of study drugs"
- Procedure: "treatment"
- Condition: "tuberculosis"
- Qualifier: "central nervous system"
- Qualifier: "bones"
- Qualifier: "joints"
- Qualifier: "miliary tuberculosis"
- Qualifier: "pericardial tuberculosis"
- Mood: "documented"
- Mood: "Suspected"
- Condition: "HIV infected"
- Condition: "HBV infected"
- Condition: "HCV infected"
- Non-representable: "(these increase the risk of TB-drug induced hepatotoxicity)"
- Measurement: "Weight"
- Value: "less than 40.0 kg"
- Condition: "allergy"
- Condition: "intolerance"
- Drug: "study medications"
- Condition: "M. tuberculosis isolate"
- Qualifier: "resistant to any of the study drugs"
- Drug: "study drugs"
- Measurement: "QTcF"
- Value: "> 500 msec"
- Non-query-able: "Other medical conditions, that, in the investigator's judgment, make study participation not in the individual's best interest."
- Temporal: "Current"
- Mood: "planned"
- Observation: "incarceration"
- Observation: "involuntary detention"
- Observation: "participated in other clinical studies"
- Drug: "investigational agents"
- Temporal: "within 8 weeks prior to trial start"
- Temporal: "currently"
- Observation: "enrolled in an investigational study"
- Reference_point: "trial start"
- Drug: "medicinal agents"
- Non-representable: "Subjects who are participating in observational studies or who are in a follow up period of a trial that included drug therapy may be considered for inclusion."